Esophageal varices observed in endoscopy,

The above is a clinical trial exclusion criterion. Annotated with entity spans:
[Condition: Esophageal varices] observed in [Procedure: endoscopy],